Patients with endometrial or epithelial ovarian cancer who following routine clinical guidelines are offered weekly taxane (paclitaxel) treatment. This will often be a third or fourth line treatment, i.e. patients with advanced disease.

The above is a clinical trial inclusion criterion. Annotated with entity spans:
Patients with [Condition: endometrial] or [Condition: epithelial ovarian cancer] who following routine clinical guidelines are offered [Multiplier: weekly] [Drug: taxane] ([Drug: paclitaxel]) [Procedure: treatment]. [Non-representable: This will often be a third or fourth line treatment, i.e. patients with advanced disease.]